LVEF < 40%

The above is a clinical trial exclusion criterion. Annotated with entity spans:
[Measurement: LVEF] [Value: < 40%]